一位 30 歲女性抱怨左手腕處疼痛 3 個月，求診時局部腫脹，觸診時明顯壓痛，同時可摸到軟組織腫塊。X 光片在左橈骨遠端骨骺（epiphysis）及幹骺（metaphysis）有一地圖樣式（geographic pattern）破壞的病灶，無骨膜反應（periosteal reaction）。最有可能的診斷為：
A. 骨囊腫（simple bone cyst）
B. 滑液膜軟骨增生症（synovial chondromatosis）
C. 纖維性骨發育不良（fibrous dysplasia）
D. 骨巨大細胞瘤（giant cell tumor of bone）

正確答案：D. 骨巨大細胞瘤（giant cell tumor of bone）